Clinical trial inclusion criterion:
Patient presented for induction of labor who is determined to be a candidate for oxytocin

Entity relations:
- Has_mood("induction of labor", "presented for")
- multi("candidate for oxytocin", "oxytocin")